¿Cuál es el gérmen que se aisla con frecuencia en las secreciones y costras de las rinitis atróficas?
1. Actynomices israelii.
2. Klebsiella ozaenae.
3. Moraxella catharralis.
4. Streptococo pneumoniae.

Respuesta correcta: 2. Klebsiella ozaenae.